¿Qué se entiende por eficiencia de un servicio sanitario?
1. La medida en que un servicio sanitario mejora el estado de salud de la población al menor coste posible.
2. La posibilidad que un sujeto tiene de ser atendido por el sistema sanitario independientemente de su condición social, sexo o lugar de nacimiento.
3. La mejora del estado de salud de la población obtenida por un servicio sanitario en condiciones habituales o reales de actuación.
4. La medida en que un servicio sanitario alcanza sus objetivos de mejora del estado de salud de la población a la cual atiende.

Respuesta correcta: 1. La medida en que un servicio sanitario mejora el estado de salud de la población al menor coste posible.